關於楔狀核（cuneate nucleus）之敘述，下列何者錯誤？
A. 可傳遞上肢震動覺
B. 發出楔狀核小腦徑（cuneocerebellar tract）
C. 可將感覺訊息傳入丘腦（thalamus）
D. 位於延髓（medulla oblongata）

正確答案：B. 發出楔狀核小腦徑（cuneocerebellar tract）